Blood pressure averaging > 159/99 mmHg

The above is a clinical trial exclusion criterion. Annotated with entity spans:
[Measurement: Blood pressure] averaging [Value: > 159/99 mmHg]